與愛滋病毒感染最不相關之伺機性感染為下列何者？
A. 肺囊蟲肺炎（Pneumocystis pneumonia）
B. 肺外結核（Extrapulmonary tuberculosis）
C. 巨細胞病毒網膜炎（Cytomegalovirus retinitis）
D. 幽門螺旋桿菌（Helicobacter pylori）感染

正確答案：D. 幽門螺旋桿菌（Helicobacter pylori）感染